Clinical trial exclusion criterion:
2. Contraindication or allergy to paracetamol or artesunate therapy

Entity relations:
- AND("Contraindication", "paracetamol")
- OR("paracetamol", "artesunate")
- OR("Contraindication", "allergy")